有氧訓練（aerobic training）對正常人之心臟功能，最不可能增加者為：
A. 最大心博量（maximal stroke volume）
B. 休息心搏量（resting stroke volume）
C. 預估最大心跳率（estimated maximum heart rate）
D. 最大心臟輸出量（maximal cardiac output）

正確答案：C. 預估最大心跳率（estimated maximum heart rate）